12. Willing to refrain from participation in any other research study for the duration of this study

The above is a clinical trial inclusion criterion. Annotated with entity spans:
12. [Post-eligibility: Willing to refrain from participation in any other research study for the duration of this study]